醫院傳染（nosocomial infection or hospital acquired infection）大多在病人住院多久之後發病？
A. 1 小時
B. 12 小時
C. 24 小時
D. 72 小時

正確答案：D. 72 小時